Mental instability or incompetence, such that the validity of informed consent or compliance with the trial is uncertain

The above is a clinical trial exclusion criterion. Annotated with entity spans:
[Post-eligibility: Mental instability or incompetence, such that the validity of informed consent or compliance with the trial is uncertain]